Clinical trial exclusion criterion:
Prior uterine scar

Annotated entities:
- Condition: "uterine scar"